Malignant tumors other than basal cell or squamous cell carcinoma of the skin, CIN(Cervical Intraepitherial Neoplasia) and CIS(Carcinoma in situ) of the cervix, and intraepithelial carcinoma of other areas Within 5 years of consent date.

The above is a clinical trial exclusion criterion. Annotated with entity spans:
[Condition: Malignant tumors] [Negation: other than] [Condition: basal cell] or [Condition: squamous cell carcinoma of the skin], [Condition: CIN(Cervical Intraepitherial Neoplasia)] and [Condition: CIS(Carcinoma in situ) of the cervix], and [Condition: intraepithelial carcinoma] of other areas [Temporal: Within 5 years of consent date].